Age ≥ 18 years

The above is a clinical trial inclusion criterion. Annotated with entity spans:
[Person: Age] [Value: ≥ 18 years]